Clinical trial exclusion criterion:
Blood pressure taken at screening and randomization is = 180 mmHg for siSBP or = 110 mmHg for siDBP.

Annotated entities:
- Measurement: "Blood pressure"
- Temporal: "at screening"
- Temporal: "at randomization"
- Value: "= 180 mmHg"
- Value: "= 110 mmHg"
- Measurement: "siDBP"
- Measurement: "siSBP"